Clinical trial exclusion criterion:
Panel reacting antibodies(PRA) >25% in most recent test or considered to be of high risk for rejection which requires an enhanced immunosuppression.

Annotated entities:
- Measurement: "Panel reacting antibodies(PRA)"
- Value: ">25%"
- Temporal: "most recent test"
- Mood: "considered to be of high risk"
- Condition: "rejection"
- Procedure: "enhanced immunosuppression"